Patients who had any complication during phacoemulsification surgery

The above is a clinical trial exclusion criterion. Annotated with entity spans:
Patients who had [Qualifier: any] [Condition: complication] [Temporal: during phacoemulsification surgery]